Clinical trial exclusion criterion:
Previous or concurrent malignancy, except for adequately treated basal cell or squamous cell skin cancer, in situ cervical cancer, or any other cancer for which the patient has been previously treated and the lifetime recurrence risk is less than 30%

Entity relations:
- Has_qualifier("cervical cancer", "in situ")
- Has_qualifier("basal cell skin cancer", "adequately treated")
- Has_negation("cervical cancer", "except")
- Has_qualifier("malignancy", "Previous")
- OR("Previous", "concurrent")
- OR("basal cell skin cancer", "squamous cell skin cancer")